Clinical trial exclusion criterion:
genital malformation

Annotated entities:
- Condition: "genital malformation"